¿Cuál de los siguientes géneros se asocia más comúnmente a infecciones urinaria en el ser humano?:
1. Escherichia.
2. Proteus.
3. Staphylococus.
4. Serratia.

Respuesta correcta: 1. Escherichia.